Cholecystectomy

The above is a clinical trial exclusion criterion. Annotated with entity spans:
[Procedure: Cholecystectomy]